一位 10 歲男童於兩天前即發生嘔吐、全身無力之症狀，醫師給予症狀治療，但病人情況惡化，因為失去知覺而送到急診室。身體檢查發現病人處於昏迷（coma）狀態，體溫 38.5℃，血壓 90/40 mmHg，心跳 160 次/分，除口腔黏膜乾燥外並未發現其他異狀，亦無神經局部病灶徵象（focal sign）。實驗室檢查顯示血糖值為 50 mg/dL，血清鈉離子濃度 125 mmol/L、鉀離子濃度 3.6 mmol/L、氯離子濃度 mmol/L，尿液鈉離子濃度 50 mmol/L。此病童最可能的診斷為何？
A. 急性腸胃炎（acute gastroenteritis）
B. 心臟衰竭（heart failure）
C. 腦炎（encephalitis）
D. 腎上腺機能不全（adrenal insufficiency）

正確答案：D. 腎上腺機能不全（adrenal insufficiency）